¿Qué enzima utiliza un retrovirus para sintetizar ADN copia de su genoma?
1. ADN polimerasa I.
2. cADN polimerasa I.
3. ARN polimerasa I.
4. cADN polimerasa II.
5. Transcriptasa inversa.

Respuesta correcta: 5. Transcriptasa inversa.